4. Have undergone bilateral mastectomy

The above is a clinical trial exclusion criterion. Annotated with entity spans:
4. Have undergone [Procedure: bilateral mastectomy]